若將骨盆底部的levator ani muscle比喻為吊床（hammock），下列何種解剖構造所扮演的功能類似吊床兩端的橫木（吊床兩端主要的附著構造）？
A. arcus tendineus levator ani（ATLA）
B. arcus tendineus fascia pelvis（ATFP）
C. obturator internus muscle
D. endopelvic fasciae

正確答案：A. arcus tendineus levator ani（ATLA）